Clinical trial exclusion criterion:
pre-operatory hypoalbuminemy

Annotated entities:
- Condition: "hypoalbuminemy"
- Qualifier: "pre-operatory"